一位 30 歲已婚女性長期有經痛，性交時常感到不適，且多年不孕症之情況，於臨床上會懷疑其是否有：
A. 子宮肌瘤
B. 子宮內膜異位症
C. 子宮內膜癌
D. 骨盆腔發炎

正確答案：B. 子宮內膜異位症